染色體檢查可用來評估急性白血病之預後，下列那一種染色體異常是屬於較好的預後因子？
A. t（8；21）
B. monosomy 7
C. t（9；22）
D. t（9；11）

正確答案：A. t（8；21）